female or male of 50 to 85 years old with a care giver

The above is a clinical trial inclusion criterion. Annotated with entity spans:
female or male of [Value: 50 to 85 years] [Person: old] with a care giver